3. Pregnancy or expectation of pregnancy during the study.

The above is a clinical trial exclusion criterion. Annotated with entity spans:
3. [Condition: Pregnancy] or [Mood: expectation] of [Condition: pregnancy] [Temporal: during the study].